Clinical trial exclusion criterion:
Central Nervous System (CNS) abnormalities (e.g., cerebral aneurysm) and/or other vascular abnormalities such as vasculitis or pre-existing stroke, motor tics or a family history or diagnosis of Tourette's syndrome, seizures (convulsions, epilepsy), or abnormal EEGs

Entity relations:
- Subsumes("Central Nervous System (CNS) abnormalities", "cerebral aneurysm")
- Subsumes("vascular abnormalities", "vasculitis")
- Has_temporal("stroke", "pre-existing")
- Has_context("Tourette's syndrome", "family history")
- Subsumes("seizures", "convulsions")
- Has_qualifier("EEGs", "abnormal")
- OR("family history", "diagnosis")
- OR("convulsions", "epilepsy")
- OR("Central Nervous System (CNS) abnormalities", "vascular abnormalities", "stroke", "motor tics", "Tourette's syndrome", "seizures", "EEGs")